History of clinical typhoid fever, clinical paratyphoid A or B fever.

The above is a clinical trial exclusion criterion. Annotated with entity spans:
[Temporal: History] of [Condition: clinical typhoid fever], [Condition: clinical paratyphoid A] or B fever.